Clinical trial exclusion criterion:
History of cataracts or glaucoma or ocular hypertension

Annotated entities:
- Condition: "cataracts"
- Condition: "glaucoma"
- Condition: "ocular hypertension"